Clinical trial exclusion criterion:
Four weeks or less since completion of treatment using an investigational product/device in another clinical study or presence of any unresolved toxicity from previous treatment

Annotated entities:
- Temporal: "Four weeks or less since completion of treatment"
- Reference_point: "completion of treatment"
- Procedure: "treatment"
- Drug: "investigational product"
- Device: "investigational device"
- Qualifier: "unresolved"
- Condition: "toxicity"
- Competing_trial: "another clinical study"
- Temporal: "previous"
- Procedure: "treatment"